Clinical trial exclusion criterion:
BDI = 30 points

Annotated entities:
- Measurement: "BDI"
- Value: "= 30 points"